70 歲女性病人接受亞全胃切除術（subtotal gastrectomy）時，下列敘述何者錯誤？
A. 不需要使用預防性抗生素
B. 要有良好的止血
C. 不要殘留異物於手術部位
D. 維持病人正常體溫

正確答案：A. 不需要使用預防性抗生素